En el ciclo de Cori el:
1. Piruvato se convierte en lactato en el hígado.
2. Lactato es fuente de glucosa en el hígado.
3. Lactato se convierte en piruvato en el músculo esquelético.
4. Piruvato es fuente de glucosa en el músculo esquelético.

Respuesta correcta: 2. Lactato es fuente de glucosa en el hígado.